有關肥厚性心肌病變（hypertrophic cardiomyopathy）的病理變化，下列何者錯誤？
A. 主動脈瓣下（subaortic region）心室中隔呈明顯肥厚
B. 心室通常會明顯擴大
C. 心肌細胞呈雜亂排列
D. 心肌間質呈現纖維化

正確答案：B. 心室通常會明顯擴大